Any other physical or psychiatric condition that may impair their ability to cooperate with study data collection.

The above is a clinical trial exclusion criterion. Annotated with entity spans:
[Post-eligibility: Any other physical or psychiatric condition that may impair their ability to cooperate with study data collection.]